Clinical trial inclusion criterion:
Undergoing abdominoplasty or TRAM flap breast reconstruction

Annotated entities:
- Procedure: "abdominoplasty"
- Procedure: "TRAM flap breast reconstruction"